Clinical trial inclusion criterion:
Subject or subject's medical decision maker agrees to participate in this study and provides informed consent

Annotated entities:
- Informed_consent: "Subject or subject's medical decision maker agrees to participate in this study and provides informed consent"